La fototerapia o terapia lumínica se utiliza para el tratamiento de:
1. Crisis de pánico.
2. Depresión mayor.
3. Trastorno bipolar.
4. Trastorno por estrés postraumático.
5. Trastorno afectivo estacional.

Respuesta correcta: 5. Trastorno afectivo estacional.